patients who have suffered a neurologic event (seizure, stroke) or who have baseline dementia, both of which could limit delirium assessment

The above is a clinical trial exclusion criterion. Annotated with entity spans:
patients who have suffered a [Condition: neurologic event] ([Condition: seizure], [Condition: stroke]) or who have [Condition: baseline dementia], [Non-representable: both of which could limit delirium assessment]